Alanine transaminase (ALT) (SGPT) ≤ 2.5 X institutional ULN

The above is a clinical trial inclusion criterion. Annotated with entity spans:
[Measurement: Alanine transaminase (ALT) (SGPT)] [Value: ≤ 2.5 X institutional ULN]